情感性疾患躁狂發作（manic episode）：依照美國精神醫學會精神疾病診斷及統計手冊第四版規定，其症狀發作之間期（duration）必須至少多少天？
A. 一
B. 四
C. 七
D. 十四

正確答案：C. 七